History of anticholinergic drug allergy or complications (allergic reaction, skin rash, urticaria and other allergic reactions which caused by drugs).

The above is a clinical trial exclusion criterion. Annotated with entity spans:
History of [Drug: anticholinergic drug] [Condition: allergy] or complications ([Condition: allergic reaction], [Condition: skin rash], [Condition: urticaria] and [Qualifier: other] [Condition: allergic reactions] which caused by [Drug: drugs]).